Clinical trial inclusion criterion:
Hepatitis B surface antigen (HBsAg) positive and <1500 IU/mL.

Entity relations:
- Subsumes("Hepatitis B surface antigen", "HBsAg")
- Has_value("Hepatitis B surface antigen", "positive")
- Has_value("Hepatitis B surface antigen", "<1500 IU/mL")